Clinical trial inclusion criterion:
Age : 18-65

Annotated entities:
- Person: "Age"
- Value: "18-65"